Clinical trial exclusion criterion:
Hepatic dysfunction defined as serum AST and/or ALT> 3 times upper limit of normal (approximately 120 IU/L however, will vary depending on age),

Annotated entities:
- Condition: "Hepatic dysfunction"
- Measurement: "serum AST"
- Measurement: "serum ALT"
- Value: "> 3 times upper limit of normal"
- Value: "approximately 120 IU/L"
- Non-representable: "will vary depending on age"